Clinical trial exclusion criterion:
Evidence of low ovarian reserve by at least one of the following: AMH = 1,5 ng/mL and/or basal CD 3 FSH = 10 mIU/mL and/or basal CD 3 Estradiol = 60 ng/mL and/or previous egg collection yield = 3 oocytes.

Annotated entities:
- Condition: "low ovarian reserve"
- Measurement: "AMH"
- Value: "= 1,5 ng/mL"
- Measurement: "basal CD 3 FSH"
- Value: "= 10 mIU/mL"
- Measurement: "basal CD 3 Estradiol"
- Value: "= 60 ng/mL"
- Measurement: "egg collection yield"
- Value: "= 3 oocytes"